Medically fit for definitive surgical management of stone.

The above is a clinical trial inclusion criterion. Annotated with entity spans:
[Mood: Medically fit for] [Procedure: definitive surgical management] of [Condition: stone].